>5 pack-year history of smoking

The above is a clinical trial inclusion criterion. Annotated with entity spans:
[Value: >5] [Measurement: pack-year] history of [Observation: smoking]